Knee symptomatic OA (Kellgren-Lawrence grade 1-4)

The above is a clinical trial inclusion criterion. Annotated with entity spans:
Knee [Qualifier: symptomatic] [Condition: OA] ([Measurement: Kellgren-Lawrence grade] [Value: 1-4])